Clinical trial exclusion criterion:
Known immediate or delayed hypersensitivity reaction or idiosyncrasy to drugs chemically related to panitumumab or excipients that contraindicates their participation.

Entity relations:
- AND("drugs chemically related to panitumumab", "idiosyncrasy")
- OR("immediate hypersensitivity reaction", "drugs chemically related to panitumumab", "delayed hypersensitivity reaction")
- OR("drugs chemically related to panitumumab", "drugs chemically related to panitumumab excipients")